Clinical trial inclusion criterion:
Medically healthy on the basis of medical history and physical examination

Annotated entities:
- Temporal: "medical history"
- Procedure: "physical examination"
- Condition: "Medically healthy"